Clinical trial inclusion criterion:
1. Males and females ≥ 18 years old.

Annotated entities:
- Parsing_Error: "1."
- Person: "Males"
- Grammar_Error: "and"
- Person: "females"
- Person: "old"
- Value: "≥ 18 years old"